Patients who were smokers

The above is a clinical trial exclusion criterion. Annotated with entity spans:
Patients who were [Condition: smokers]